Señale la respuesta correcta en relación con la regulación de la hematopoyesis:
1. La altitud inhibe la hematopoyesis.
2. La eritropoyetina inhibe la hematopoyesis.
3. La hipoxia estimula la producción de la eritropoyetina.
4. La eritropoyetina se sintetiza en el hígado.
5. La eritropoyetina no influye en la producción de glóbulos rojos.

Respuesta correcta: 3. La hipoxia estimula la producción de la eritropoyetina.